known allergy to clopidogrel or acetylsalicylic acid precluding its administration as specified by the protocol

The above is a clinical trial exclusion criterion. Annotated with entity spans:
known [Condition: allergy] to [Drug: clopidogrel] or [Drug: acetylsalicylic acid] [Non-representable: precluding its administration] as specified by the protocol